Clinical trial inclusion criterion:
Inclusion criteria includes all U.S. HCA hospitals with an adult ICU;

Entity relations:
- multi("adult ICU", "adult")
- AND("HCA hospitals", "U.S.")
- AND("HCA hospitals", "adult ICU")